Clinical trial exclusion criteria:
Total lesion area of >12 DA or >30.5 mm2
The existence of subretinal hemorrhage area constituting =50% of total lesion area
The existence of scar or fibrosis area constituting =50% of total lesion area
The existence of RPE tear
Prior treatment for wet AMD
History of vitrectomy surgery, submacular surgery, or other surgical intervention for AMD
The pregnant or lactating woman

Annotated entities:
- Measurement: "Total lesion area"
- Value: ">12 DA"
- Value: ">30.5 mm2"
- Measurement: "subretinal hemorrhage area"
- Value: "=50% of total lesion area"
- Measurement: "scar area"
- Measurement: "fibrosis area"
- Value: "=50% of total lesion area"
- Condition: "RPE tear"
- Temporal: "Prior"
- Procedure: "treatment"
- Procedure: "vitrectomy surgery"
- Procedure: "submacular surgery"
- Procedure: "surgical intervention"
- Qualifier: "other"
- Condition: "AMD"
- Condition: "pregnant"
- Condition: "lactating"
- Person: "woman"